Clinical trial inclusion criterion:
Normal weight as defined by a Body Mass Index (BMI, weight in kg divided by the square of height in meters) of 18.0 to 30.0 kg/m2, extremes included

Entity relations:
- Subsumes("Body Mass Index", "BMI")
- Has_value("Body Mass Index", "18.0 to 30.0 kg/m2, extremes included")
- AND("Normal weight", "Body Mass Index")
- OR("BMI", "weight in kg divided by the square of height in meters")